Lactante de 1 mes de vida que acude a urgencias del hospital remitido por su pediatra por ictericia. Refiere ésta desde hace 10 días y ha ido en aumento. En la analítica de sangre destaca una bilirrubina total de 7 mg/dl siendo la bilirrubina indirecta de 1,5 mg/dl. La causa más probable, de entre las siguientes, de esta ictericia es:
1. Atresia de vías biliares.
2. Ictericia por lactancia materna.
3. Isoinmunización 0-A de aparición tardía.
4. Enfermedad de Gilbert.
5. Esferocitosis hereditaria.

Respuesta correcta: 1. Atresia de vías biliares.